Clinical trial exclusion criterion:
Major surgery (e.g., requiring general anesthesia) <=30 days before first dose of study treatment. Subjects must have recovered from any surgery related toxicities.

Entity relations:
- Has_index("<=30 days before first dose of study treatment", "first dose of study treatment")
- AND("Major surgery", "general anesthesia")
- Has_temporal("Major surgery", "<=30 days before first dose of study treatment")